與人類子宮頸癌相關之病毒是：
A. 人類乳頭瘤病毒（Human Papilloma virus）第十八型
B. EB 病毒（Epstein-Barr virus）
C. 腺病毒（Adenovirus）第七型
D. 反轉錄病毒（Retrovirus）

正確答案：A. 人類乳頭瘤病毒（Human Papilloma virus）第十八型